Clinical trial exclusion criterion:
Drug-related liver disease

Annotated entities:
- Condition: "Drug-related liver disease"